Clinical trial inclusion criteria:
Written informed consent
Adult patients (older than 18 years of age), male and female, with chronic non-cancer and cancer pain (at least 3 months in duration)
Patients experiencing an average weekly pain intensity score greater than 4 on a 11 points NRS
Subject agreed to follow the protocol
Naïve cannabis patients with chronic non-cancer and cancer pain (not used cannabis in any presentation in the last 12 weeks)
Patients receiving opioids and other concomitant pain medications should have a stable dose for the last 15 days.
Normal cognitive status according to MiniCog
Normal liver function (defined as aspartate aminotransferase 10-40 U/L and alanine aminotransferase 7-56 U/L)
Normal renal function (defined as serum creatinine level <133 µmol/L and Estimated Glomerular Filtration Rate (eGFR) greater than or equal to 60)
Negative result on ßhuman chorionic gonadotropin pregnancy test (if applicable)
Ability to read and respond to questions in French or English.
A male volunteer with sexual partners who are pregnant, possibly pregnant, or who could become pregnant must be surgically sterile or agrees to use one of the accepted contraceptive regimens from first drug administration until 3 months after the last drug administration.

Annotated entities:
- Informed_consent: "Written informed consent"
- Person: "Adult"
- Value: "older than 18 years"
- Person: "age"
- Person: "male"
- Person: "female"
- Qualifier: "chronic"
- Qualifier: "non-cancer"
- Qualifier: "cancer"
- Condition: "pain"
- Multiplier: "at least 3 months in duration"
- Measurement: "average weekly pain intensity score on a 11 points NRS"
- Value: "greater than 4"
- Informed_consent: "Subject agreed to follow the protocol"
- Qualifier: "chronic"
- Qualifier: "non-cancer"
- Qualifier: "cancer"
- Condition: "pain"
- Measurement: "not"
- Drug: "cannabis"
- Temporal: "in the last 12 weeks"
- Condition: "Naïve cannabis"
- Drug: "opioids"
- Drug: "pain medications"
- Qualifier: "other"
- Qualifier: "stable dose"
- Temporal: "for the last 15 days"
- Procedure: "MiniCog"
- Condition: "Normal cognitive status"
- Condition: "Normal liver function"
- Measurement: "aspartate aminotransferase"
- Value: "10-40 U/L"
- Measurement: "alanine aminotransferase"
- Value: "7-56 U/L"
- Condition: "Normal renal function"
- Measurement: "serum creatinine level"
- Value: "<133 µmol/L"
- Measurement: "Estimated Glomerular Filtration Rate (eGFR)"
- Value: "greater than or equal to 60"
- Value: "Negative"
- Measurement: "ßhuman chorionic gonadotropin pregnancy test"
- Non-representable: "if applicable"
- Non-query-able: "Ability to read and respond to questions in French or English."
- Pregnancy_considerations: "A male volunteer with sexual partners who are pregnant, possibly pregnant, or who could become pregnant must be surgically sterile or agrees to use one of the accepted contraceptive regimens from first drug administration until 3 months after the last drug administration."